What is the chemical structure of Etanercept (ETN)?

Etanercept has the best retention rate in rheumatic diseases, but is less effective in granulomatous diseases, such as inflammatory bowel diseases or uveitis . It possesses three N- and 13 O-glycosylation sites, with multiple N-and-IgG1-N-G sites . It is a fusion protein, composed of the Fc portion of IgG1 and the extracellular domain of the TNF receptor .